How is oprozomib administered?

Oprozomib is administered orally.